¿Cuál es el reservorio de Salmonella typhi A en una persona portadora?
1. Los divertículos del colon.
2. La vesícula biliar.
3. El intestino delgado.
4. El intestino grueso.

Respuesta correcta: 2. La vesícula biliar.